Describe what is the advantage of using a stain free protein gel in a Western Blot experiment?

Stain-Free technology can be used as a normalization tool in Western blot analysis.